Clinical trial exclusion criterion:
Kidney or liver disease or advanced-stage cardiopulmonary

Entity relations:
- OR("Kidney disease", "advanced-stage cardiopulmonary", "liver disease")